Clinical trial inclusion criterion:
Discharged from hospital following non-trauma related admission

Annotated entities:
- Procedure: "Discharged from hospital"
- Procedure: "non-trauma related admission"
- Visit: "hospital"